一位 20 歲男性患者，因為胃腸息肉而接受檢查，發現在嘴唇有許多黑色 pigmentation，請問：最可能的診斷為何？
A. Osler-Weber-Rendu syndrome
B. Familial adenomatous polyposis
C. Peutz-Jeghers syndrome
D. Hereditary nonpolyposis colorectal cancer

正確答案：C. Peutz-Jeghers syndrome